Clinical trial exclusion criterion:
Exclusions Related to Cardiovascular Disease

Annotated entities:
- Parsing_Error: "Exclusions Related to Cardiovascular Disease"